Age ≥ 18 years.

The above is a clinical trial inclusion criterion. Annotated with entity spans:
[Person: Age] [Value: ≥ 18 years].